下列關於胸腺惡性腫瘤（malignant thymoma）的敘述，何者錯誤？
A. 最常見於前縱膈腔，好發於中年者，男女約各半
B. 約有1/3合併重症肌無力
C. 有心包膜（pericardium）或肋膜（pleura）侵犯時，治療以手術切除合併化學治療為主
D. 重症肌無力患者實施胸腺切除手術，會比單獨內科治療有較高的症狀緩解率

正確答案：C. 有心包膜（pericardium）或肋膜（pleura）侵犯時，治療以手術切除合併化學治療為主